Negative result on ßhuman chorionic gonadotropin pregnancy test (if applicable)

The above is a clinical trial inclusion criterion. Annotated with entity spans:
[Value: Negative] result on [Measurement: ßhuman chorionic gonadotropin pregnancy test] ([Non-representable: if applicable])